Patients with a history of anaphylactic allergy to eggs or egg products, manifested by one or more of the following symptoms: generalized urticaria, difficulty in breathing, swelling of the mouth and throat, hypotension, or shock. (Subjects with nonanaphylactic allergies to eggs or egg products may be enrolled in the study, but must be watched carefully for 1 h following the administration of SONAZOID).

The above is a clinical trial exclusion criterion. Annotated with entity spans:
Patients with a history of [Condition: anaphylactic allergy] to [Drug: eggs] or [Drug: egg products], manifested by one or more of the following symptoms: [Condition: generalized urticaria], [Condition: difficulty in breathing], [Condition: swelling of the mouth] and throat, [Condition: hypotension], or [Condition: shock]. (Subjects with nonanaphylactic allergies to eggs or egg products may be enrolled in the study, but must be watched carefully for 1 h following the administration of SONAZOID).